Clinical trial exclusion criterion:
Clinical diagnosis of chronic or acute alcoholism

Entity relations:
- Has_qualifier("alcoholism", "chronic")
- Has_qualifier("alcoholism", "Clinical diagnosis")
- OR("chronic", "acute")